Clinical trial exclusion criterion:
Multifetal pregnancy.

Annotated entities:
- Condition: "Multifetal pregnancy"